Clinical trial exclusion criterion:
Use of alternative therapies or natural products to treat postmenopausal symptoms in the four weeks prior to randomization.

Entity relations:
- AND("alternative therapies", "postmenopausal symptoms")
- Has_temporal("alternative therapies", "in the four weeks prior to randomization")
- OR("alternative therapies", "natural products")